dimethyl fumarate, or

The above is a clinical trial inclusion criterion. Annotated with entity spans:
[Drug: dimethyl fumarate], or